Undergoing mid-urethral sling surgery

The above is a clinical trial inclusion criterion. Annotated with entity spans:
Undergoing [Procedure: mid-urethral sling surgery]